下列有關廣東住血線蟲（Angiostrongylus cantonensis）感染人體的敘述，有幾項敘述是正確的？①人因食入 未熟帶蟲的蝸牛而感染 ②人體為終宿主（final host） ③蟲體只侵犯人體腦脊髓 ④引起嗜酸性白血球明顯增加
A. 1項
B. 2項
C. 3項
D. 4項

正確答案：B. 2項